Clinical trial inclusion criterion:
In good general health based on medical history and physical exam

Entity relations:
- Has_temporal("good general health", "medical history")
- AND("good general health", "physical exam")